下 列 有 關 大 動 脈 轉 位 （ t r a n s p o s i t i o n   o f   t h e   g r e a t   a r t e r i e s ） 之 敘 述 ， 何 者 錯 誤 ？
A. 主動脈由右心室出來，肺動脈由左心室出來
B. 若沒合併心室中隔缺損，出生後需要有卵圓孔或開放性動脈導管以維持血氧之供給
C. 預後差，開心手術死亡率在50% 以上
D. 開心手術前，prostaglandin E1靜脈治療或經心導管執行心房中隔造孔術，可能有助於血氧之改善

正確答案：C. 預後差，開心手術死亡率在50% 以上